Clinical trial inclusion criterion:
Patient has given written informed consent prior to any study-specific procedures. Patients with psychiatric or addictive disorders which prevent them from giving their informed consent must not enter the study.

Annotated entities:
- Condition: "psychiatric disorders"
- Condition: "addictive disorders"
- Observation: "giving informed consent"
- Negation: "prevent"